Clinical trial inclusion criterion:
Kidney Transplant recipients, after the first episode of cytomegalovirus infection, using the current immunosuppressive regimen: azathioprine or mycophenolate, tacrolimus and prednisone.

Annotated entities:
- Condition: "cytomegalovirus infection"
- Drug: "immunosuppressive regimen"
- Drug: "azathioprine"
- Drug: "mycophenolate"
- Drug: "tacrolimus"
- Drug: "prednisone"